Subjects must have normal or clinically acceptable physical exam

The above is a clinical trial inclusion criterion. Annotated with entity spans:
Subjects must have [Value: normal] or [Value: clinically acceptable] [Procedure: physical exam]